Clinical trial exclusion criterion:
Inability to provide written informed consent

Annotated entities:
- Post-eligibility: "Inability to provide written informed consent"